Clinical trial exclusion criterion:
Any condition which, in the opinion of the investigator, prevents the subject from participation in the study.

Annotated entities:
- Condition: "condition"
- Qualifier: "which prevents the subject from participation in the study"
- Non-representable: "in the opinion of the investigator"
- Non-representable: "Any condition which, in the opinion of the investigator, prevents the subject from participation in the study."